乳癌之橘皮或豬皮樣病變（peau d'orange）是由於：
A. 皮下淋巴管阻塞
B. 皮下血管阻塞
C. 皮膚潰瘍
D. 乳管阻塞

正確答案：A. 皮下淋巴管阻塞